Undergoing concomitant prolapse surgery

The above is a clinical trial exclusion criterion. Annotated with entity spans:
Undergoing concomitant [Procedure: prolapse surgery]